Clinical trial exclusion criterion:
contraindication against ibuprofen (known or suspected allergy against ibuprofen, anaphylactic reaction against Nonsteroidal anti-inflammatory drugs (NSAID), active or recurrent stomach or duodenal ulcera or bleeding, severe liver or renal insufficiency, inflammatory bowel syndrome, and pregnancy/breastfeeding)

Entity relations:
- AND("contraindication", "ibuprofen")
- Has_qualifier("allergy", "known")
- AND("allergy", "ibuprofen")
- AND("anaphylactic reaction", "Nonsteroidal anti-inflammatory drugs (NSAID)")
- Has_qualifier("ulcera", "stomach")
- Has_temporal("ulcera", "active")
- Subsumes("contraindication", "allergy")
- OR("known", "suspected")
- OR("ulcera", "bleeding")
- OR("stomach", "duodenal")
- OR("active", "recurrent")
- OR("allergy", "breastfeeding", "severe renal insufficiency", "severe liver insufficiency", "anaphylactic reaction", "ulcera", "inflammatory bowel syndrome", "pregnancy")